Clinical trial inclusion criterion:
histologically proven prostate adenocarcinoma within 1 year of enrollment

Annotated entities:
- Condition: "prostate adenocarcinoma"
- Qualifier: "histologically proven"
- Temporal: "within 1 year of enrollment"
- Reference_point: "enrollment"